如果子宮頸位置向前（anterior），其硬度中等（medium），薄度（effacement）40～50%，開口3～4公分，胎頭位於-1，其Bishop score是多少？
A. 4
B. 6
C. 8
D. 10

正確答案：C. 8